At least two cases in the family

The above is a clinical trial inclusion criterion. Annotated with entity spans:
[Multiplier: At least two] [Undefined_semantics: cases in the family]